Indique cuál de las siguientes afirmaciones es correcta sobre la colitis ulcerosa:
1. Puede aparecer en cualquier punto del tubo digestivo aunque el sitio afectado con mayor frecuencia es el íleon terminal.
2. La inflamación afecta a la capa mucosa y submucosa.
3. La hemorragia rectal es poco frecuente en esta patología.
4. Son pacientes que habitualmente tienen fistulas y abscesos anales.

Respuesta correcta: 2. La inflamación afecta a la capa mucosa y submucosa.